和人體免疫反應有關的各種細胞是由下列何種細胞分化而來？
A. 腦細胞（brain cells）
B. 幹細胞（stem cells）
C. 巨噬細胞（macrophages）
D. 淋巴細胞（lymphocytes）

正確答案：B. 幹細胞（stem cells）